Infection

The above is a clinical trial exclusion criterion. Annotated with entity spans:
[Condition: Infection]